Clinical trial exclusion criterion:
Carbamazepine, phenytoin, phenobarbital, oxcarbazepine

Annotated entities:
- Drug: "Carbamazepine"
- Drug: "phenytoin"
- Drug: "phenobarbital"
- Drug: "oxcarbazepine"